Clinical trial inclusion criterion:
Abdominal obesity (>88cm women, >102cm men) AND hyperlipidemia (treated or fasting total cholesterol >240 English literacy Willing to provide informed consent

Entity relations:
- Has_value("women", ">88cm")
- Has_value("men", ">102cm")
- AND("Abdominal obesity", "women")
- Has_value("fasting total cholesterol", ">240")
- Has_mood("provide informed consent", "Willing to")
- Subsumes("hyperlipidemia", "treated")
- OR("women", "men")
- OR("treated", "fasting total cholesterol")